Major surgical procedure or significant traumatic injury within approximately 28 days prior to randomization or anticipation of the need for major surgery during the course of study treatment.

The above is a clinical trial exclusion criterion. Annotated with entity spans:
[Qualifier: Major] [Procedure: surgical procedure] or [Qualifier: significant] [Condition: traumatic injury] [Temporal: within approximately 28 days prior to randomization] or [Mood: anticipation of the need] for [Procedure: major surgery] [Temporal: during the course of study treatment].